一位20歲男性因持續性胸痛2個月求診，胸部X-ray及電腦斷層檢查顯示：前縱隔腔腫瘤併主動脈侵犯，alpha-fetoprotein和 beta-HCG為正常，下列何者錯誤？
A. 應先切除腫瘤，之後要以化學治療為輔助性治療（adjuvant treatment）
B. 治療前應先做切片檢查
C. 應檢查生殖腺是否有病變
D. 這種腫瘤對放射線治療可能有反應

正確答案：A. 應先切除腫瘤，之後要以化學治療為輔助性治療（adjuvant treatment）